allergy to study drugs

The above is a clinical trial exclusion criterion. Annotated with entity spans:
[Condition: allergy] to [Drug: study drugs]